Plan on having continued sexual contact with partner

The above is a clinical trial inclusion criterion. Annotated with entity spans:
[Mood: Plan on] [Observation: having continued sexual contact with partner]